Clinical trial exclusion criterion:
history of hypersensitivity to test drugs

Annotated entities:
- Temporal: "history"
- Condition: "hypersensitivity"
- Drug: "test drugs"